PSA = 2 ng/mL at screening

The above is a clinical trial inclusion criterion. Annotated with entity spans:
[Measurement: PSA] [Value: = 2 ng/mL] at screening